Clinical trial exclusion criterion:
Active and/or chronic protein losing enteropathy or plastic bronchitis (on inhaled medication to control the plastic bronchitis).

Entity relations:
- AND("plastic bronchitis", "inhaled medication")
- Has_qualifier("protein losing enteropathy", "Active")
- OR("Active", "chronic")
- OR("protein losing enteropathy", "plastic bronchitis")